The patient and/or the patient's parent/legal guardian is willing and able to provide signed informed consent.

The above is a clinical trial inclusion criterion. Annotated with entity spans:
[Post-eligibility: The patient and/or the patient's parent/legal guardian is willing and able to provide signed informed consent].